Pretreatment with any CYP3A inducers or inhibitors

The above is a clinical trial inclusion criterion. Annotated with entity spans:
[Procedure: Pretreatment] with any [Drug: CYP3A inducers] or inhibitors